Clinical trial inclusion criteria:
Diagnosis of diabetes mellitus according to World Health Organization criteria ( treatment with insulin or an oral hypoglycemic agent, twice random glucose measurements major than 200 mg/dl, or a fasting glucose major than 140 mg/dl)
Ulcer located on the legs or feet, stage III or IV (Wagner Classification System)
The subject agrees to comply with study protocol requirements and all follow up visit requirements.

Annotated entities:
- Condition: "diabetes mellitus"
- Qualifier: "World Health Organization criteria"
- Drug: "insulin"
- Procedure: "treatment"
- Drug: "oral hypoglycemic agent"
- Multiplier: "twice"
- Measurement: "random glucose measurements"
- Value: "major than 200 mg/dl"
- Measurement: "fasting glucose"
- Value: "major than 140 mg/dl"
- Condition: "Ulcer"
- Qualifier: "legs"
- Qualifier: "feet"
- Measurement: "stage"
- Value: "III or IV"
- Qualifier: "Wagner Classification System"
- Informed_consent: "The subject agrees to comply with study protocol requirements and all follow up visit requirements"